Clinical trial exclusion criterion:
Heart failure stage D as defined by American Heart Association (7).

Annotated entities:
- Condition: "Heart failure"
- Measurement: "stage"
- Value: "D"
- Qualifier: "American Heart Association"